Which R package can infer protein-protein interactions via thermal proximity coaggregation (TPCA)?

Rtpca is an R package implementing methods for inferring protein-protein interactions based on thermal proteome profiling experiments of a single condition or in a differential setting via an approach called thermal proximity coaggregation (TPCA). Rtpca can be used for high-throughput intracellular monitoring of protein complex dynamics.